Uncontrolled bleeding tendency (prothrombin conc. Less than 70%)

The above is a clinical trial exclusion criterion. Annotated with entity spans:
[Qualifier: Uncontrolled] [Condition: bleeding tendency] ([Measurement: prothrombin] conc. [Value: Less than 70%])